關於多囊性卵巢症候群（polycystic ovary syndrome, PCOS）的治療敘述，下列何者錯誤？
A. 使用抗雄性激素藥物來治療痤瘡（青春痘，acne）
B. 可以單獨使用胰島素敏感劑（如：Metformin）來刺激排卵
C. 治療以改變生活型態（減肥減重）（=飲食控制+運動）為主，臨床症狀之治療為輔
D. 以clomiphene citrate來治療不排卵

正確答案：B. 可以單獨使用胰島素敏感劑（如：Metformin）來刺激排卵